Clinical trial exclusion criterion:
Anterior uveitis or iritis (past or present)

Entity relations:
- Has_temporal("Anterior uveitis", "past")
- OR("Anterior uveitis", "iritis")
- OR("past", "present")